Decreased blood pressure, causing symptoms (symptomatic hypotension),

The above is a clinical trial exclusion criterion. Annotated with entity spans:
[Qualifier: Decreased] [Condition: blood pressure], causing [Condition: symptoms] ([Qualifier: symptomatic] [Condition: hypotension]),